Clinical trial inclusion criterion:
No other melanoma treatment during the protocol.

Annotated entities:
- Condition: "melanoma"
- Temporal: "during the protocol"
- Procedure: "treatment"